Clinical trial inclusion criterion:
No previous history of endoscopic, radiologic, or surgical therapy for varices or ascites

Entity relations:
- AND("endoscopic therapy", "varices")
- Has_negation("endoscopic therapy", "No")
- OR("endoscopic therapy", "radiologic therapy", "surgical therapy")
- OR("varices", "ascites")